剛出生的34週大的嬰兒，嘴角一直流口水並冒出泡泡，值班醫師無法順利將鼻胃管放入。出生12小時後KUB 發現無腸氣，下列那個診斷最有可能？
A. 單純食道氣管瘻管
B. 食道閉鎖合併上段食道氣管瘻管
C. 食道閉鎖合併下段食道氣管瘻管
D. 食道閉鎖合併上段及下段食道氣管瘻管

正確答案：B. 食道閉鎖合併上段食道氣管瘻管